Clinical trial exclusion criterion:
Patients with an established infection (diagnostic test required) e.g. acute malaria, dengue, leptospirosis, typhoid, Japanese encephalitis etc.

Annotated entities:
- Condition: "infection"
- Procedure: "diagnostic test"
- Condition: "acute malaria"
- Condition: "dengue"
- Condition: "leptospirosis"
- Condition: "typhoid"
- Condition: "Japanese encephalitis"